Contraindications for Magnetic resonance (MR) scanning such as persons with cardiac pacemaker and implants out of metal or claustrophobia

The above is a clinical trial exclusion criterion. Annotated with entity spans:
[Condition: Contraindications] for [Procedure: Magnetic resonance (MR) scanning] such as persons with [Device: cardiac pacemaker] and [Device: implants out of metal] or [Condition: claustrophobia]